Signs of kidney injury/failure

The above is a clinical trial exclusion criterion. Annotated with entity spans:
[Mood: Signs of] [Condition: kidney injury]/failure